Clinical trial exclusion criterion:
Metal plate in skull

Annotated entities:
- Device: "Metal plate in skull"